Patient with asthma or COPD, patient who is severely respiratory depressed

The above is a clinical trial exclusion criterion. Annotated with entity spans:
Patient with [Condition: asthma] or [Condition: COPD], patient who is [Qualifier: severely] [Condition: respiratory depressed]